Chronic diseases

The above is a clinical trial exclusion criterion. Annotated with entity spans:
[Condition: Chronic diseases]